Clinical trial inclusion criterion:
patients with severe left ventricle dysfunction with an ejection fraction (EF)=40%, being scheduled for revascularization.

Entity relations:
- Has_value("ejection fraction (EF)", "=40%")
- AND("being scheduled for", "revascularization")
- Has_qualifier("left ventricle dysfunction", "severe")